Clinical trial exclusion criterion:
Electrocardiographic abnormalities or organic heart diseases;

Annotated entities:
- Condition: "Electrocardiographic abnormalities"
- Qualifier: "organic"
- Condition: "heart diseases"
- Procedure: "Electrocardiographic"